Clinical trial exclusion criterion:
pectus carinatum, Poland's syndrome, or any chest wall anomaly other than pectus excavatum

Entity relations:
- Has_negation("pectus excavatum", "other than")
- AND("chest wall anomaly", "pectus excavatum")
- OR("pectus carinatum", "Poland's syndrome", "chest wall anomaly")